Clinical trial inclusion criterion:
Adults (= 18 years of age) with World Health Organization Group 2 Pulmonary Hypertension (Mean pulmonary artery pressure = 25 mmHg and pulmonary capillary wedge pressure = 15 mmHg)

Annotated entities:
- Person: "Adults"
- Value: "= 18 years"
- Person: "age"
- Condition: "Pulmonary Hypertension"
- Qualifier: "World Health Organization Group 2"
- Measurement: "(Mean pulmonary artery pressure"
- Value: "= 25 mmHg"
- Measurement: "pulmonary capillary wedge pressure"
- Value: "= 15 mmHg"